Clinical trial exclusion criterion:
pregnant or breastfeeding

Entity relations:
- OR("pregnant", "breastfeeding")